下列何者的收縮與張口動作最無關係？
A. 內翼肌（medial pterygoid muscle）
B. 外翼肌（lateral pterygoid muscle）
C. 下頜舌骨肌（mylohyoid muscle）
D. 頦舌肌（geniohyoid muscle）

正確答案：A. 內翼肌（medial pterygoid muscle）